Historical or current evidence of clinically significant or rapidly progressing or unstable cardiovascular, neurological, cardiovascular, neurological, renal, hepatic, immunological, endocrine (including uncontrolled diabetes or thyroid disease) or hematological abnormalities that are uncontrolled. Significant is defined as any disease that, in the opinion of the investigator, would put the safety of the subject at risk through participation, or which would affect the analysis if the disease/condition exacerbated during the study.

The above is a clinical trial exclusion criterion. Annotated with entity spans:
[Observation: Historical] or [Temporal: current] evidence of [Qualifier: clinically significant] or [Qualifier: rapidly progressing] or [Qualifier: unstable] [Condition: cardiovascular], [Condition: neurological], [Condition: cardiovascular], [Condition: neurological], [Condition: renal], [Condition: hepatic], [Condition: immunological], [Condition: endocrine] (including [Qualifier: uncontrolled] [Condition: diabetes] or [Condition: thyroid disease]) or [Condition: hematological abnormalities] that are [Qualifier: uncontrolled]. [Non-representable: Significant is defined as any disease that, in the opinion of the investigator, would put the safety of the subject at risk through participation, or which would affect the analysis if the disease/condition exacerbated during the study.]